Poorly controlled diabetes mellitus (HbA1C > 7.5)

The above is a clinical trial exclusion criterion. Annotated with entity spans:
[Qualifier: Poorly controlled] [Condition: diabetes mellitus] ([Measurement: HbA1C] [Value: > 7.5])